Clinical trial exclusion criterion:
Patients with abnormal TSH concentration

Annotated entities:
- Measurement: "TSH"
- Value: "abnormal"